關於器官移植的精神科評估與治療，下列何者錯誤？
A. 器官受贈者時常會經歷許多生活適應上的困難與挑戰
B. 器官的等待、移植評估、術後的適應過程時常會產生壓力性反應
C. 器官受贈者最常見的精神疾病是創傷後壓力症候群
D. 移植手術後的長期類固醇治療可能會引起情緒障礙

正確答案：C. 器官受贈者最常見的精神疾病是創傷後壓力症候群